What is caused by loss-of-function variants in BCAS3?

Bi-allelic loss-of-function variants in BCAS3 cause a syndromic neurodevelopmental disorder.